Clinical trial exclusion criterion:
Current pregnancy

Entity relations:
- Has_temporal("pregnancy", "Current")